Clinical trial inclusion criterion:
Patients on regular hemodialysis 3sessions/wk.

Annotated entities:
- Procedure: "regular hemodialysis"
- Multiplier: "3sessions/wk"